下列何種橫膈膜裂孔疝氣（hiatal hernia）所占比例最多？
A. Type I（sliding hiatal hernia）
B. Type II（paraesophageal hiatal hernia）
C. Type III（mixed hiatal hernia）
D. Type IV（herniation of organs other than stomach into the chest）

正確答案：A. Type I（sliding hiatal hernia）